Clinical trial exclusion criterion:
Pregnant or lactating females, or if sexually active and of childbearing potential, not using adequate methods of birth control.

Annotated entities:
- Pregnancy_considerations: "Pregnant or lactating females, or if sexually active and of childbearing potential, not using adequate methods of birth control"